Patients who have a seizure disorder

The above is a clinical trial exclusion criterion. Annotated with entity spans:
Patients who have a [Condition: seizure disorder]